Clinical trial inclusion criterion:
No signs of infection

Entity relations:
- Has_negation("signs of infection", "No")